Clinical trial exclusion criterion:
Obesity (women with a body mass index >35 kg/m2 or men with a body mass index >42 kg/m2)

Annotated entities:
- Condition: "Obesity"
- Person: "women"
- Measurement: "body mass index"
- Value: ">35 kg/m2"
- Person: "men"
- Measurement: "body mass index"
- Value: ">42 kg/m2"